Known secondary causes (genetic, endocrine, or metabolic) for obesity (eg, Prader-Willi syndrome, Bardet Biedl syndrome, Down's Syndrome, untreated hypothyroidism, Cushing's syndrome, daily systemic corticosteroid exposure for longer than 30 days, history of significant exposure to corticosteroids for chronic illness during the past year; inhaled steroids will be allowed)

The above is a clinical trial exclusion criterion. Annotated with entity spans:
Known [Condition: secondary causes] ([Qualifier: genetic], [Qualifier: endocrine], or [Qualifier: metabolic]) for obesity (eg, [Condition: Prader-Willi syndrome], [Condition: Bardet Biedl syndrome], [Condition: Down's Syndrome], [Condition: untreated hypothyroidism], [Condition: Cushing's syndrome], [Multiplier: daily] [Drug: systemic corticosteroid] exposure [Temporal: for longer than 30 days], [Temporal: history] of [Qualifier: significant exposure] to [Drug: corticosteroids] for [Condition: chronic illness] [Temporal: during the past year]; [Non-representable: inhaled steroids will be allowed])